下列有關腦傷患者的吞嚥問題，何者錯誤？
A. 腦傷患者發生吞嚥問題很常見
B. 腦傷患者吞嚥不良（dysphagia）和認知（cognition）及運動控制困難（motor control difficulties）有很大關係
C. 腦傷患者發生流口水（drooling）的問題可用藥物或手術加以治療
D. 腦傷患者的吞嚥反射不會受損，故不易發生吸入性（aspiration）肺炎的問題

正確答案：D. 腦傷患者的吞嚥反射不會受損，故不易發生吸入性（aspiration）肺炎的問題